Healthy as determined by a responsible and experienced physician, based on a medical evaluation including medical history, physical examination, laboratory tests and cardiac monitoring. A subject with a clinical abnormality or laboratory parameter(s) which is/are not specifically listed in the inclusion or exclusion criteria, outside the reference range for the population being studied may be included only if the Investigator in consultation with the GSK Medical Monitor if required agree and document that the finding is unlikely to introduce additional risk factors and will not interfere with the study procedures.

The above is a clinical trial inclusion criterion. Annotated with entity spans:
[Condition: Healthy] [Qualifier: as determined by a responsible and experienced physician], based on a [Procedure: medical evaluation] including [Temporal: medical history], [Procedure: physical examination], [Procedure: laboratory tests] and [Procedure: cardiac monitoring]. [Non-query-able: A subject with a clinical abnormality or laboratory parameter(s) which is/are not specifically listed in the inclusion or exclusion criteria, outside the reference range for the population being studied may be included only if the Investigator in consultation with the GSK Medical Monitor if required agree and document that the finding is unlikely to introduce additional risk factors and will not interfere with the study procedures.]